Clinical trial exclusion criterion:
Non-English speaking patients

Annotated entities:
- Non-query-able: "Non-English speaking patients"